乳房改良性根除性切除術中，需避免傷害下列那些神經？①胸背神經（thoracodorsal nerve） ②長胸神經（long thoracic nerve） ③內乳神經（internal mammary nerve） ④膈神經（phrenic nerve)
A. ①②③
B. 僅②③
C. ③④
D. ①④

正確答案：A. ①②③